Clinical trial inclusion criterion:
PaCO2 < 50mm Hg

Annotated entities:
- Measurement: "PaCO2"
- Value: "< 50mm Hg"